esmolol administration in the previous 30 days

The above is a clinical trial exclusion criterion. Annotated with entity spans:
[Drug: esmolol] administration [Temporal: in the previous 30 days]